Clinical trial exclusion criterion:
Any surgical or medical condition, which in the opinion of the investigator, may place the patient at higher risk from his/her participation in the study, or is likely to prevent the patient from complying with the requirements of the study or completing the study

Annotated entities:
- Condition: "medical condition"
- Condition: "surgical condition"
- Non-query-able: "in the opinion of the investigator"
- Qualifier: "place the patient at higher risk from his/her participation in the study"
- Mood: "likely to prevent the patient from"
- Informed_consent: "complying with the requirements of the study"
- Negation: "prevent"